Clinical trial inclusion criteria:
1) age 50-70
2) stroke within the past 6 to 60 months,
3) major depressive disorder (PHQ-9 > 10) and diagnosed using the Structured Clinical Interview for Depression (SCID) according to the Diagnostic and Statistical Manual of Mental Disorders, Fourth Edition (DSM-IV),
4) residual paresis in the lower extremity (Fugl-Meyer LE motor score <34),
5) ability to walk without assistance and without an AFO on the treadmill ≥ 30 seconds at speeds ranging from 0.2-0.8 m/s,
6) no antidepressant medications or clinically able to discontinue medications,
7) HRSD question #9 regarding suicide <2,
8) provision of informed consent. In addition, all subjects who meet criteria for the training portion must complete an exercise tolerance test and be cleared for participation by the study cardiologist.

Annotated entities:
- Person: "age"
- Value: "50-70"
- Parsing_Error: "1)"
- Condition: "stroke"
- Temporal: "within the past 6 to 60 months"
- Parsing_Error: "2)"
- Condition: "major depressive disorder"
- Measurement: "PHQ-9"
- Value: "> 10"
- Procedure: "Structured Clinical Interview for Depression (SCID) according to the Diagnostic and Statistical Manual of Mental Disorders, Fourth Edition (DSM-IV)"
- Parsing_Error: "3)"
- Condition: "residual paresis"
- Qualifier: "lower extremity"
- Measurement: "Fugl-Meyer LE motor score"
- Value: "<34"
- Parsing_Error: "4)"
- Condition: "ability to walk without assistance"
- Measurement: "AFO on the treadmill"
- Value: "≥ 30 seconds"
- Negation: "without"
- Qualifier: "speeds"
- Value: "from 0.2-0.8 m/s"
- Parsing_Error: "5)"
- Drug: "antidepressant"
- Negation: "no"
- Condition: "clinically able to discontinue medications"
- Undefined_semantics: "clinically able to discontinue medications"
- Subjective_judgement: "clinically able to discontinue medications"
- Parsing_Error: "6)"
- Measurement: "HRSD question #9"
- Value: "<2"
- Parsing_Error: "7)"
- Non-query-able: "provision of informed consent."
- Post-eligibility: "In addition, all subjects who meet criteria for the training portion must complete an exercise tolerance test and be cleared for participation by the study cardiologist."
- Parsing_Error: "8)"